Clinical trial exclusion criteria:
Babies who have been close to death
Seizure occurred by metabolic factors (hypoglycemia, hypocalcemia, electrolyte disorder)
Babies who have received phenobarbitone or any other anticonvulsive medication before hospitalization
Abnormal renal function

Annotated entities:
- Observation: "close to death"
- Temporal: "have been"
- Person: "Babies"
- Condition: "Seizure"
- Qualifier: "metabolic factors"
- Condition: "hypoglycemia"
- Condition: "hypocalcemia"
- Condition: "electrolyte disorder"
- Person: "Babies"
- Drug: "phenobarbitone"
- Qualifier: "any other"
- Drug: "anticonvulsive medication"
- Temporal: "before hospitalization"
- Procedure: "hospitalization"
- Reference_point: "hospitalization"
- Value: "Abnormal"
- Measurement: "renal function"
- Condition: "Abnormal renal function"